What is RiboTag profiling?

Ribo tag is a flexible tool for measuring the translational state of targeted cells in heterogeneous cell types and organisms. It is a simple, sensitive, rapid and relatively cheap method for integrative epigenomic profiling. The method can be used to identify endogenous and ectopically expressed ribosomal RNAs (RP), which are then analyzed using a simple two-step protocol with 500-50,000 cells and reveals the interplay between genomic locations of ubiquitously expressed proteins.